Clinical trial exclusion criterion:
Body mass index more than 35

Annotated entities:
- Measurement: "Body mass index"
- Value: "more than 35"